Clinical trial inclusion criterion:
American Society of Anesthesiology (ASA) I-III;

Annotated entities:
- Measurement: "American Society of Anesthesiology (ASA)"
- Value: "I-III"